下列 nonsteroidal anti-inflammatory drugs（NSAID），何者較無抑制血小板凝集之藥理作用？
A. Naproxen
B. Piroxicam
C. Celecoxib
D. Nabumetone

正確答案：C. Celecoxib